Clinical trial exclusion criterion:
7. Unable to wean steroids to ≤0.5 mg/kg/day prednisone.

Entity relations:
- AND("wean", "steroids")
- Has_value("prednisone", "≤0.5 mg/kg/day")
- Subsumes("steroids", "prednisone")
- Has_negation("wean", "Unable")